Clinical trial exclusion criterion:
Decompensated liver cirrhosis (CTP score = 7).

Annotated entities:
- Condition: "Decompensated liver cirrhosis"
- Measurement: "CTP score"
- Value: "= 7"